Clinical trial inclusion criterion:
hospitalized for heart failure in last 12 months

Annotated entities:
- Observation: "hospitalized"
- Condition: "heart failure"
- Temporal: "in last 12 months"